OSDI < 30 points

The above is a clinical trial inclusion criterion. Annotated with entity spans:
[Measurement: OSDI] [Value: < 30 points]